Clinical trial exclusion criterion:
need for therapies that may obscure the results of treatment and/or of the study

Annotated entities:
- Non-query-able: "need for therapies that may obscure the results of treatment and/or of the study"